La absorbancia de una disolución media en el punto isosbéstico es aquella determinada a:
1. La longitud de onda a la que los coeficientes de absorción molar de dos especies absorbentes en equilibrio químico, interconvertibles entre sí, son equivalentes.
2. La longitud de onda a la que los coeficientes de absorción molar de dos especies absorbentes en equilibrio químico, no son equivalentes.
3. La longitud de onda a la que la forma ácida de un indicador es máxima.
4. La longitud de onda a la que la forma ácida de un indicador es mínima.
5. La longitud de onda de las especies que participan en el equilibrio cuando está desplazada hacia longitudes de onda mayores.

Respuesta correcta: 1. La longitud de onda a la que los coeficientes de absorción molar de dos especies absorbentes en equilibrio químico, interconvertibles entre sí, son equivalentes.